Which sequence-based algorithm for branch point prediction has been proposed?

BPP is a sequence-based algorithm for branch point prediction.